The patient agrees to all protocol required follow-up intervals.

The above is a clinical trial inclusion criterion. Annotated with entity spans:
The patient [Observation: agrees to all protocol required follow-up intervals].